The antibodies MK-3475 and CT-011 have shown promising results in treating malignancies. Which protein are they targeting?

PD-1